Clinical trial exclusion criterion:
Creatinine clearance <30 mL/min

Entity relations:
- Has_value("Creatinine clearance", "<30 mL/min")